Clinical trial exclusion criterion:
Smoker or former smoker.

Annotated entities:
- Condition: "Smoker"
- Condition: "former smoker"